有關非傷寒沙門氏菌（nontyphoidal Salmonella）感染，下列何者不須常規使用抗生素治療？
A. 大於3個月大之嬰兒
B. 腹脹且有毒性病容
C. 合併菌血症
D. 病人有sickle cell disease

正確答案：A. 大於3個月大之嬰兒